Body mass index (BMI) less than or equal to 32

The above is a clinical trial inclusion criterion. Annotated with entity spans:
[Measurement: Body mass index (BMI)] [Value: less than or equal to 32]